Clinical trial exclusion criterion:
history of substance abuse (except painkillers)

Annotated entities:
- Condition: "substance abuse"
- Negation: "except"
- Drug: "painkillers"